要了解病人每日之體液平衡（fluid balance），測量下列那一項最好？
A. 每日尿量排泄
B. 估算每日進出液體平衡（intake-output balance）值
C. 每日量體重
D. 每天測血鈉濃度（serum Na）

正確答案：C. 每日量體重